Clinical trial inclusion criterion:
Have normal screening laboratories for urine protein and urine glucose

Annotated entities:
- Value: "normal"
- Measurement: "urine protein"
- Measurement: "urine glucose"